Diabetic macular edema involving the center of the macula

The above is a clinical trial inclusion criterion. Annotated with entity spans:
[Condition: Diabetic macular edema] involving the [Qualifier: center of the macula]